下列何者是毒殺型 T 細胞（cytotoxic T cell）的共同接受器（co-receptor）？
A. CD2
B. CD3
C. CD4
D. CD8

正確答案：D. CD8